一位 37 歲婦女工廠作業員，因最近二週逐漸四肢無力求診。六個月前病人有眼瞼（eyelid）腫及乾眼現象，兩個月前在上眼瞼及手指邊出現紅斑，一個月前無法舉高雙手及無法從座椅上站起來，下列那一種檢查是最重要之檢查？
A. 白血球數目
B. 下肢 X-ray
C. Creatine phosphokinase
D. 免疫球蛋白

正確答案：C. Creatine phosphokinase